Clinical trial exclusion criterion:
Significant periphery edema;

Annotated entities:
- Condition: "periphery edema"
- Qualifier: "Significant"